A positive drug screen for illicit drugs

The above is a clinical trial exclusion criterion. Annotated with entity spans:
A [Value: positive] [Procedure: drug screen for illicit drugs]